一個年紀 65 歲男性，三星期前鞏膜及皮膚逐漸變黃，且最近二天大便顏色變為灰白色。無上腹痛，亦無發燒。理學檢查發現右上腹有一無痛性硬塊。請問下列診斷何者較不適當？
A. 急性肝炎
B. 胰頭癌
C. 膽道阻塞
D. 壺腹周圍腫瘤

正確答案：A. 急性肝炎